Clinical trial exclusion criterion:
Current infectious disease needs antibiotics therapy

Entity relations:
- AND("infectious disease", "antibiotics")